肺靜脈回流完全異常（total anomalous pulmonary venous return）的病人，雖有不同程度的缺氧狀態（desaturated），一般皆可以採用選擇性（elective）手術方式來處理，但有下列何種情況，則必須以緊急性（emergent）手術方式處理？
A. 有混合型的回流路徑者
B. 心上型（supracardiac type）肺靜脈回流完全異常
C. 不論那一型，只要回流路徑有阻塞（obstructed）者
D. 心內型（intracardiac type）肺靜脈回流完全異常，但不流入冠狀竇（coronary sinus）而是直接注入右心房者

正確答案：C. 不論那一型，只要回流路徑有阻塞（obstructed）者